Mujer de 68 años de edad que es diagnosticada de una tuberculosis pulmonar. Se instauró tratamiento con Isoniacida, Rifampicina y Etambutol. A los 12 días de iniciado el tratamiento consulta por fiebre de 38ºC, exantema cutáneo, adenopatías, artralgia, dolor lumbar, oliguria y eosinofilia con deterioro agudo de la función renal. En el examen de orina se identificó hematuria, leucocituria con eosinofiluria en la tinción de Wright y proteinuria en rango no nefrótico (1,2 gramos diarios). Con estos datos clínicos el diagnóstico más probable es:
1. Necrosis tubular aguda por nefrotoxicidad a fármacos.
2. Necrosis tubular aguda de etiología isquémica.
3. Enfermedad ateroembólica.
4. Oclusión trombótica de la arteria renal principal.
5. Nefritis tubulointersticial aguda.

Respuesta correcta: 5. Nefritis tubulointersticial aguda.